關於多發性內分泌腫瘤（multiple endocrine neoplasia, MEN）之敘述，下列何者錯誤？
A. MEN 1 包含腦下腺、副甲狀腺及胰島素瘤
B. MEN 2A 與 MEN 2B 之共同特徵是甲狀腺髓質癌（medullary thyroid cancer）及副甲狀腺瘤
C. MEN 2A 與 MEN 2B 都是 RET 致癌基因之突變所致
D. 對於 MEN 2，在嬰幼兒期作全甲狀腺切除手術，大多有助於減少因甲狀腺髓質癌之死亡

正確答案：B. MEN 2A 與 MEN 2B 之共同特徵是甲狀腺髓質癌（medullary thyroid cancer）及副甲狀腺瘤